Any cardiac surgery within the past 60 days (2 months) or valvular cardiac surgical procedure at any time (i.e., ventriculotomy, atriotomy, and valve repair or replacement and presence of a prosthetic valve)

The above is a clinical trial exclusion criterion. Annotated with entity spans:
Any [Procedure: cardiac surgery] [Temporal: within the past 60 days] ([Temporal: 2 months]) or [Procedure: valvular cardiac surgical] procedure at any time (i.e., [Procedure: ventriculotomy], [Procedure: atriotomy], and [Procedure: valve repair] or replacement and presence of a [Device: prosthetic valve)]